Clinical trial exclusion criterion:
Any known history of hypersensitivity to interferon.

Annotated entities:
- Condition: "hypersensitivity"
- Drug: "interferon"